Clinical trial exclusion criterion:
Chronic illness that, in the opinion of the investigator, is at a stage where it might interfere with trial conduct or completion

Annotated entities:
- Subjective_judgement: "Chronic illness that, in the opinion of the investigator, is at a stage where it might interfere with trial conduct or completion"